Healthy at inclusion

The above is a clinical trial inclusion criterion. Annotated with entity spans:
[Condition: Healthy] [Temporal: at inclusion]